The dura damage during surgery

The above is a clinical trial exclusion criterion. Annotated with entity spans:
The [Observation: dura damage] during [Procedure: surgery]